Clinical trial exclusion criterion:
Allergy to pivmecillinam

Entity relations:
- AND("Allergy", "pivmecillinam")